participation in other clinical studies with experimental therapies at the time of enrollment and preceding 3 months

The above is a clinical trial exclusion criterion. Annotated with entity spans:
[Competing_trial: participation in other clinical studies with experimental therapies at the time of enrollment and preceding 3 months]